Clinical trial exclusion criterion:
Known or suspected sensitivity to Dexamethasone Acetate (DXA)

Entity relations:
- Has_context("sensitivity to Dexamethasone Acetate (DXA)", "Known")
- OR("Known", "suspected")